Clinical trial exclusion criterion:
Hepatic impairment (aspartate aminotransferase more than three times normal) or renal function impairment (serum creatinine level >133 µmol/L, Estimated Glomerular Filtration Rate (eGFR) <60)

Annotated entities:
- Condition: "Hepatic impairment"
- Measurement: "Estimated Glomerular Filtration Rate (eGFR)"
- Value: "<60"
- Measurement: "aspartate aminotransferase"
- Value: "more than three times normal"
- Condition: "renal function impairment"
- Measurement: "serum creatinine level"
- Value: ">133 µmol/L"